Clinical trial exclusion criterion:
Patients with a value of alpha-fetoprotein >100 ng/mL are excluded, unless stability (less than 10% increase) has been documented over at least the previous 3 months.

Entity relations:
- Has_value("alpha-fetoprotein", ">100 ng/mL")
- Has_index("at least the previous 3 months", "the previous 3 months")
- Has_value("increase", "less than 10%")
- Subsumes("stability", "increase")
- Has_temporal("stability", "at least the previous 3 months")
- Has_negation("stability", "unless")